Conditions which render a subject ineligible for the study at the discretion of the investigator

The above is a clinical trial exclusion criterion. Annotated with entity spans:
[Non-representable: Conditions which render a subject ineligible for the study at the discretion of the investigator]